Clinical trial inclusion criterion:
HBsAg-positive for more than 6 months and HBV DNA < 2000 IU/ml (Subgroup 1)or HBsAg-negative but anti-HBc positive with HBV DNA < 2000 IU/ml (Subgroup 2).

Entity relations:
- Has_value("HBsAg", "positive")
- Has_temporal("HBsAg", "more than 6 months")
- Has_value("HBV DNA", "< 2000 IU/ml")
- Has_value("HBsAg", "negative")
- Has_value("anti-HBc", "positive")
- Has_value("HBV DNA", "< 2000 IU/ml")
- OR("HBsAg", "HBsAg")
- OR("HBV DNA", "HBsAg")